Delirium

The above is a clinical trial exclusion criterion. Annotated with entity spans:
[Condition: Delirium]